¿Qué se entiende por “Reactancia Psicológica”?:
1. La reacción motivacional que se produce como consecuencia de percibir una amenaza a la libertad de acción, es decir, ante la pérdida de control personal.
2. Una reacción emocional que conlleva agresión física frente a una amenaza percibida.
3. Una respuesta verbal reactiva cuya intencionalidad es responder a una afrenta recibida.
4. La hiperreactividad emocional y fisiológica que se produce ante situaciones amenazantes.

Respuesta correcta: 1. La reacción motivacional que se produce como consecuencia de percibir una amenaza a la libertad de acción, es decir, ante la pérdida de control personal.